Known allergy to one of the study drugs

The above is a clinical trial exclusion criterion. Annotated with entity spans:
Known [Condition: allergy] to one of the [Drug: study drugs]